一位28歲女性因氣喘控制不良，長期服用口服類固醇，而產生體重增加及情緒失調，若繼續下去，也可能造成股骨頭缺血性壞死（avascular necrosis）。下列有關病情告知的敘述，何者最正確？
A. 擔心告知後，會讓病人害怕而停止服藥造成氣喘惡化，故不應告知
B. 為避免類固醇副作用的產生，不論氣喘控制與否，建議病人減少用量
C. 告知病情，由病人自行決定是否繼續服用類固醇
D. 不說明理由轉介至其它專科醫師處理

正確答案：C. 告知病情，由病人自行決定是否繼續服用類固醇